Describe GARLIC (GWAS-based Prediction Toolkit for Connecting Diseases and Cell Types)

GARLIC is a bioinformatic toolkit for aetiologically connecting diseases and cell type-specific regulatory maps.